Clinical trial inclusion criterion:
Positive for at least one of the anti-islet autoantibodies: GADA, IA2A, ZnT8A

Entity relations:
- Subsumes("anti-islet autoantibodies", "GADA")
- Has_multiplier("anti-islet autoantibodies", "at least one")
- OR("GADA", "IA2A", "ZnT8A")